¿Cuál de los siguientes equilibrios químicos es heterogéneo?
1. Equilibrio ácido-base.
2. Equilibrio de formación de complejos.
3. Equilibrio de precipitación.
4. Equilibrio de oxidación-reducción.
5. Todos aquellos equilibrios que tienen lugar en una sola fase, generalmente líquida.

Respuesta correcta: 3. Equilibrio de precipitación.